El desarrollo de células B en la médula ósea:
1. Es dependiente del antígeno.
2. Comienza con reordenamientos génicos en la cadena ligera kappa.
3. Es dependiente de células estromales.
4. Comienza con reordenamientos génicos en la cadena pesada delta.
5. Es dependiente de linfocitos T.

Respuesta correcta: 3. Es dependiente de células estromales.